¿Qué sabor considera que puede enmascarar el sabor amargo de una solución oral:
1. Regaliz.
2. Albaricoque.
3. Vainilla.
4. Anís.
5. Frambuesa.

Respuesta correcta: 4. Anís.